下列何種細菌的特徵是初步判定為單核球增多性李斯特菌（Listeria monocytogenes）感染之重要依據？
A. 溶血性
B. 運動性
C. 染色法
D. 血清型

正確答案：B. 運動性